下列何者為臨床上常見造成小兒氣喘之致敏原（allergen）？
A. 頭蝨（head louse）
B. 跳蚤（flea）
C. 塵蟎（dust mite）
D. 狗蜱（dog tick）

正確答案：C. 塵蟎（dust mite）